What disease is the drug aducanumab targeting?

Aducanumab is an anti-Aβ antibody being developed for the treatment of Alzheimer's disease (AD).